What are the indications for hydrochlorothiazide?

Hydrochlorothiazide is a diuretic, often used in combination with others. Hydrochlorothiazide are used to treat hypertension. Hydrochlorothiazide has been shown to decrease diastolic blood pressure.